Sustained monomorphic VT documented on 12-lead ECG or rhythm strip terminated by pharmacologic means or DC cardioversion

The above is a clinical trial inclusion criterion. Annotated with entity spans:
[Qualifier: Sustained] [Condition: monomorphic VT] documented on [Procedure: 12-lead ECG] or [Procedure: rhythm strip] terminated by [Procedure: pharmacologic means] or [Procedure: DC cardioversion]